有關微生物及癌症的關係，下列何者關聯性最低？
A. Helicobacter pylori  vs.胃癌（gastric cancer）
B. Human papilloma virus vs.子宮癌（uterine cancer）
C. Human herpesvirus type 8 vs.卡波氏肉瘤（Kaposi's sarcoma）
D. Epstein-Barr virus vs.霍金氏淋巴癌（Hodgkin's lymphoma）

正確答案：B. Human papilloma virus vs.子宮癌（uterine cancer）